Clinical trial exclusion criterion:
Renal dysfunction defined as serum creatinine >2.0mg/dL

Entity relations:
- AND("Renal dysfunction", "serum creatinine")
- Has_value("serum creatinine", ">2.0mg/dL")